BRCA1 carrier

The above is a clinical trial inclusion criterion. Annotated with entity spans:
[Condition: BRCA1 carrier]